colostomy, or do not perform regular bowel care for any reason

The above is a clinical trial exclusion criterion. Annotated with entity spans:
[Procedure: colostomy], or [Negation: do not perform] [Procedure: regular bowel care] for any reason